Clinical trial exclusion criterion:
Significant hepatic or renal impairment (and/or alanine transaminase(ALT) or Aspartate transaminase(AST) >2 times upper limit of normal, creatinine clearance rate(CCr)<50%);

Entity relations:
- Has_qualifier("hepatic impairment", "Significant")
- Has_value("Aspartate transaminase(AST)", ">2 times upper limit of normal")
- Has_value("creatinine clearance rate(CCr)", "<50%")
- Subsumes("hepatic impairment", "alanine transaminase(ALT)")
- OR("hepatic impairment", "renal impairment")
- OR("alanine transaminase(ALT)", "creatinine clearance rate(CCr)", "Aspartate transaminase(AST)")